Patients unable or unwilling to provide written, informed consent

The above is a clinical trial exclusion criterion. Annotated with entity spans:
[Post-eligibility: Patients unable or unwilling to provide written, informed consent]